Follicles > 16 mm at the triggering day between 5-14

The above is a clinical trial inclusion criterion. Annotated with entity spans:
[Measurement: Follicles > 16 mm] [Temporal: at the triggering day] [Value: between 5-14]